Clinical trial inclusion criteria:
Male
18 years of age
Presenting with hernia requiring surgical intervention

Annotated entities:
- Person: "Male"
- Value: "18 years"
- Person: "age"
- Condition: "hernia"
- Mood: "requiring"
- Procedure: "surgical intervention"